El tipo de transporte de membrana que usa gradientes iónicos como fuente de energía es:
1. Difusión facilitada.
2. Transporte pasivo.
3. Transporte activo primario.
4. Transporte activo secundario.
5. Difusión simple.

Respuesta correcta: 4. Transporte activo secundario.